Any condition that the investigators feel could compromise the use of the current medication.

The above is a clinical trial exclusion criterion. Annotated with entity spans:
[Post-eligibility: Any condition that the investigators feel could compromise the use of the current medication.]